Clinical trial exclusion criterion:
Unstable medical disease of comorbid psychiatric disease

Annotated entities:
- Condition: "Unstable medical disease"
- Condition: "comorbid psychiatric disease"